Clinical trial exclusion criterion:
Implanted medical devices that are incompatible with MRI imaging.

Annotated entities:
- Device: "medical devices"
- Procedure: "MRI imaging"
- Qualifier: "incompatible with MRI imaging"